Clinical trial exclusion criterion:
History of tuberculosis , presence of active tuberculosis, or latent tuberculosis

Entity relations:
- Has_qualifier("tuberculosis", "active")
- Has_qualifier("tuberculosis", "latent")
- Has_temporal("tuberculosis", "History")
- OR("tuberculosis", "tuberculosis", "tuberculosis")